Clinical trial inclusion criterion:
American Society of Anesthesiologists (ASA) I e II;

Entity relations:
- Has_value("American Society of Anesthesiologists (ASA)", "I e II")